Presentation with acute liver failure, defined as presence of hepatic encephalopathy and coagulopathy (INR > 1.5)

The above is a clinical trial exclusion criterion. Annotated with entity spans:
Presentation with [Condition: acute liver failure], defined as presence of [Condition: hepatic encephalopathy] and [Condition: coagulopathy] ([Measurement: INR] [Value: > 1.5])